El tratamiento de elección de la Arteritis de Células Gigantes (Arteritis de la Temporal o Arteritis de Horton) corticodependiente es:
1. Etanercept.
2. Ciclofosfamida endovenosa.
3. AINE.
4. Metotrexate.
5. Rituximab.

Respuesta correcta: 4. Metotrexate.